連接交感神經鏈（sympathetic chain）與 L4 脊神經的是：
A. 白交通支（white communicating ramus），內含交感節前神經纖維
B. 白交通支，內含交感節後神經纖維
C. 灰交通支（gray communicating ramus），內含交感節前神經纖維
D. 灰交通支，內含交感節後神經纖維

正確答案：D. 灰交通支，內含交感節後神經纖維